Clinical trial exclusion criterion:
No Beta-Blockers

Annotated entities:
- Negation: "No"
- Drug: "Beta-Blockers"